張小姐是一位中年的職業婦女，近半年經常感到疲倦無力、睡不著覺、食慾減低、有時會莫名的悲傷哭泣。根據精神疾病診斷與統計手冊第四版（DSM-IV），診斷憂鬱症尚需要有那種症狀？
A. 失去興趣或快樂感
B. 多話
C. 出現聽幻覺
D. 焦慮情緒

正確答案：A. 失去興趣或快樂感